Clinical trial exclusion criterion:
Suicidal patients and/or severe automutilation behavior and/or psychotic symptoms and/or lack of event memory.

Annotated entities:
- Condition: "Suicidal"
- Condition: "automutilation behavior"
- Qualifier: "severe"
- Condition: "psychotic symptoms"
- Condition: "lack of event memory"